Clinical trial exclusion criterion:
Inability to swallow or issues with malabsorption

Annotated entities:
- Condition: "Inability to swallow"
- Condition: "issues with malabsorption"
- Undefined_semantics: "issues with malabsorption"